Clinical trial exclusion criterion:
Lifetime history of Bipolar Disorder, Dementia, Autism Spectrum Disorder, Schizophrenia, or any other Psychotic Disorder.

Annotated entities:
- Condition: "Bipolar Disorder"
- Condition: "Dementia"
- Condition: "Autism Spectrum Disorder"
- Condition: "Schizophrenia"
- Condition: "Psychotic Disorder"